常用來治療疱疹病毒的阿昔洛韋（Acyclovir）會被病毒的何種酵素磷酸化，進而抑制病毒的複製？
A. 胞苷激酶（cytidine kinase）
B. 胸苷激酶（thymidine kinase）
C. 酪氨酸激酶（tyrosine kinase）
D. 周期蛋白依賴性激酶（cyclin dependent kinase）

正確答案：B. 胸苷激酶（thymidine kinase）